一項研究收案 700 名無肺癌者與 700 名肺癌患者，分別詢問其抽菸習慣，肺癌患者有 70 位抽菸者， 無肺癌者有 26 位抽菸者，這屬於下列那一種研究法？
A. 世代研究（cohort studies）
B. 病例對照研究（case-control studies）
C. 生態研究（ecological studies）
D. 橫斷式研究（cross-sectional studies）

正確答案：B. 病例對照研究（case-control studies）